一位 4 個月大女童曾經罹患 4 次皮膚膿瘍（abscess），這次又因屁股（buttock）有個膿瘍住院，她的外婆說，此女童臍帶比其他外孫晚 3 週才掉，而且有發生臍帶感染，您認為下列何種檢驗最能證實此病？
A. IgG subclass
B. Lymphocyte subsets
C. Nitroblue tetrazolium test
D. CD11/CD18 expression on flow cytometry

正確答案：D. CD11/CD18 expression on flow cytometry